Recent myocardial infarction (within the last 3 months)

The above is a clinical trial exclusion criterion. Annotated with entity spans:
Recent [Condition: myocardial infarction] (within [Temporal: the last 3 months])